Clinical trial inclusion criteria:
Patients undergoing ambulatory hand surgery for carpal tunnel and trigger finger, under local anesthesia with or without sedation.

Annotated entities:
- Qualifier: "ambulatory"
- Procedure: "hand surgery"
- Condition: "carpal tunnel"
- Condition: "trigger finger"
- Procedure: "local anesthesia"